Clinical trial inclusion criterion:
major elective gastrointestinal, gynecological, prostate or bladder surgery patients who are = 60 years old.

Annotated entities:
- Qualifier: "elective"
- Procedure: "gastrointestinal surgery"
- Procedure: "bladder surgery"
- Procedure: "prostate surgery"
- Procedure: "gynecological surgery"
- Value: "= 60 years old"
- Person: "old"